Clinical trial exclusion criterion:
History or other evidence of a medical condition associated with chronic liver disease other than HBV (e.g., hemochromatosis, autoimmune hepatitis, metabolic liver diseases including Wilson's and alpha1-antitrypsin deficiency, alcoholic liver disease, toxin exposures, thalassemia).

Entity relations:
- AND("medical condition", "chronic liver disease")
- Has_negation("HBV", "other than")
- Subsumes("metabolic liver diseases", "Wilson's")
- Subsumes("other than", "Wilson's")
- AND("medical condition", "HBV")
- OR("hemochromatosis", "metabolic liver diseases", "autoimmune hepatitis")
- OR("Wilson's", "toxin exposures", "alcoholic liver disease", "alpha1-antitrypsin deficiency", "thalassemia")